Clinical trial exclusion criterion:
Hypersensitivity to spironolactone, chlorthalidone, amlodipine, human recombinant insulin or Definity

Annotated entities:
- Condition: "Hypersensitivity"
- Drug: "spironolactone"
- Drug: "chlorthalidone"
- Drug: "amlodipine"
- Drug: "human recombinant insulin"